Clinical trial exclusion criteria:
Patients are not expected to be alive for longer than 3 months.
Mini-mental State Examination (MMSE) [18] score = 23.
history of dementia, psychiatric illness or any diseases of central nervous system.
current use of sedatives or antidepressant.
alcoholism and drug dependence.
patients previously included in this study (for patients who have second intra-abdominal surgery during the study period).
difficult to follow up or patients with poor compliance.
uncontrolled hypertension (> 180/100 mmHg)

Annotated entities:
- Observation: "expected to be alive"
- Negation: "not"
- Value: "longer than 3 months"
- Measurement: "Mini-mental State Examination (MMSE)"
- Value: "= 23"
- Condition: "dementia"
- Condition: "psychiatric illness"
- Condition: "diseases of central nervous system"
- Drug: "sedatives"
- Temporal: "current"
- Drug: "antidepressant"
- Condition: "alcoholism"
- Condition: "drug dependence"
- Non-query-able: "patients previously included in this study (for patients who have second intra-abdominal surgery during the study period)."
- Non-query-able: "difficult to follow up or patients with poor compliance."
- Condition: "uncontrolled hypertension"
- Value: "> 180/100 mmHg"